若睪丸腫瘤在顯微鏡檢發現 Schiller-Duval bodies，免疫組織染色α-fetoprotein 腫瘤細胞呈陽性，請問 下列何種診斷最適當？
A. Embryonal carcinoma
B. Choriocarcinoma
C. Seminoma
D. Yolk sac tumor

正確答案：D. Yolk sac tumor